Endoscopically confirmed active upper gastrointestinal hemorrhage on Day 1.

The above is a clinical trial exclusion criterion. Annotated with entity spans:
[Qualifier: Endoscopically confirmed] [Temporal: active] [Condition: upper gastrointestinal hemorrhage] [Temporal: on Day 1].